Creatinine <_1.6 mg/dl or creatinine clearance >_60 cc/min.

The above is a clinical trial inclusion criterion. Annotated with entity spans:
[Measurement: Creatinine] [Value: <_1.6 mg/dl] or [Measurement: creatinine clearance] [Value: >_60 cc/min].